¿Cuál de las siguientes enzimas controla la tasa de síntesis de colesterol?:
1. Mevalonato quinasa.
2. Hidroximetiglutaril–CoA (HMG-CoA) reductasa.
3. HMG-CoA sintasa.
4. HMG-CoA liasa.

Respuesta correcta: 2. Hidroximetiglutaril–CoA (HMG-CoA) reductasa.